一位 50 歲男性，因幾天來發現解大便後，在擦拭肛門的衛生紙上有血，但並無其他症狀，家族中也沒有大腸直腸癌的病例，所以至門診接受檢查。Hb15 g/dL、stool OB(+)，肛門鏡檢查發現有內痔但未見出血，經安排大腸鏡檢查，發現在乙狀結腸有一個 1.2 公分左右的可動性 semisessile 息肉，表面有部分不平整，則該如何處理？
A. 只作切片再觀察就夠
B. 觀察即可
C. 直接安排開腹手術
D. 先作內視鏡息肉切除再議

正確答案：D. 先作內視鏡息肉切除再議